Clinical trial inclusion criterion:
Laparoscopic cholecystectomy

Annotated entities:
- Procedure: "cholecystectomy"
- Qualifier: "Laparoscopic"